Interested in taking 3 months of varenicline

The above is a clinical trial inclusion criterion. Annotated with entity spans:
[Post-eligibility: Interested in taking 3 months of varenicline]